Being pregnant

The above is a clinical trial exclusion criterion. Annotated with entity spans:
Being [Condition: pregnant]